Clinical trial exclusion criterion:
Antiemetics or steroids use within 24 hrs prior to surgery

Annotated entities:
- Drug: "Antiemetics"
- Drug: "steroids use"
- Temporal: "within 24 hrs prior to surgery"
- Reference_point: "surgery"
- Procedure: "surgery"